acute alcohol withdrawal

The above is a clinical trial exclusion criterion. Annotated with entity spans:
[Condition: acute alcohol withdrawal]